Clinical trial inclusion criteria:
Male sex
ASA status I or II
BMI between 20 and 34 kg/m2
Cruciate ligament of the knee reconstructive surgery
No contraindications to general and regional anesthesia

Annotated entities:
- Person: "Male"
- Measurement: "ASA status"
- Value: "I or II"
- Measurement: "BMI"
- Value: "between 20 and 34 kg/m2"
- Procedure: "reconstructive surgery"
- Qualifier: "Cruciate ligament of the knee"
- Condition: "contraindications"
- Procedure: "regional anesthesia"
- Procedure: "general anesthesia"
- Negation: "No"